對腎上腺機能低下症之診斷，不可用下列何種方法？
A. 基礎血中皮促素及皮醇測定
B. 皮促素刺激試驗
C. 胰島素耐性試驗
D. Dexamethasone suppression test

正確答案：D. Dexamethasone suppression test